Retransplantation or multiorgan transplantation

The above is a clinical trial exclusion criterion. Annotated with entity spans:
[Procedure: Retransplantation] or [Qualifier: multiorgan] [Procedure: transplantation]